Clinical trial inclusion criterion:
Patients with a histologically, radiologically or haematologically confirmed malignancy whose pain is judged by the investigator to be caused by the malignancy

Entity relations:
- AND("malignancy", "pain")
- Has_value("histologically", "confirmed")
- OR("histologically", "radiologically", "haematologically")